diagnosis of ADHD

The above is a clinical trial inclusion criterion. Annotated with entity spans:
diagnosis of [Condition: ADHD]